Symptoms suggestive of obstructive or central sleep apnea (with a score of > 10 on Epworth sleepiness scale)

The above is a clinical trial exclusion criterion. Annotated with entity spans:
Symptoms suggestive of [Condition: obstructive] or [Condition: central sleep apnea] (with a [Value: score of > 10] on [Measurement: Epworth sleepiness scale])